Clinical trial exclusion criterion:
Resting heart rate <60 beat per minute (bpm).

Entity relations:
- Subsumes("<60 beat per minute", "<60 bpm")
- Has_qualifier("heart rate", "Resting")
- Has_value("heart rate", "<60 beat per minute")